Los tromboxanos:
1. Inducen la agregación plaquetaria.
2. Inhiben la agregación plaquetaria.
3. Actúan como broncodilatadores en el sistema respiratorio.
4. Se producen en las membranas de todas las células.
5. Son derivados de los ácidos grasos saturados.

Respuesta correcta: 1. Inducen la agregación plaquetaria.